下列那一類的病人在服用 chlorpromazine 後，會加重其病情？
A. 焦慮症
B. 精神分裂症
C. 失眠症
D. 巴金森氏症

正確答案：D. 巴金森氏症